Hydrocephalus.

The above is a clinical trial exclusion criterion. Annotated with entity spans:
[Condition: Hydrocephalus].